Clinical trial exclusion criterion:
Concurrent medication limiting validity of neuropsychological tests or imaging.

Annotated entities:
- Temporal: "Concurrent"
- Drug: "medication"
- Qualifier: "limiting validity of neuropsychological tests"
- Qualifier: "limiting validity of imaging"